Clinical trial exclusion criteria:
History of active rheumatic diseases
History of previous musculoskeletal injury of the same knee for excluding patients with secondary knee osteoarthritis
History of previous surgery on the same knee
History of adverse effects from medications to be used in this study
Contraindication to spinal anesthesia
History of psychiatric disorders or cognitive impairment
Contraindication to corticosteroid agents
Poorly controlled diabetes mellitus (HbA1C > 7.5)
Poorly controlled hypertension
History of ischemic heart disease or peripheral arterial disease or cerebrovascular disease
Hepatic insufficiency (Child-Pugh score > 5)
Renal insufficiency (Creatinine clearance < 30 mL/min)
History of cataracts or glaucoma or ocular hypertension
History of steroid or immunosuppressive drug use within 6 months of surgery

Annotated entities:
- Condition: "rheumatic diseases"
- Qualifier: "active"
- Condition: "musculoskeletal injury"
- Qualifier: "knee"
- Condition: "secondary knee osteoarthritis"
- Procedure: "surgery"
- Qualifier: "knee"
- Non-representable: "History of adverse effects from medications to be used in this study"
- Condition: "Contraindication"
- Procedure: "spinal anesthesia"
- Condition: "psychiatric disorders"
- Condition: "cognitive impairment"
- Condition: "Contraindication"
- Drug: "corticosteroid"
- Condition: "diabetes mellitus"
- Qualifier: "Poorly controlled"
- Measurement: "HbA1C"
- Value: "> 7.5"
- Qualifier: "Poorly controlled"
- Condition: "hypertension"
- Condition: "ischemic heart disease"
- Condition: "peripheral arterial disease"
- Condition: "cerebrovascular disease"
- Condition: "Hepatic insufficiency"
- Measurement: "Child-Pugh score"
- Value: "> 5"
- Condition: "Renal insufficiency"
- Measurement: "Creatinine clearance"
- Value: "< 30 mL/min"
- Condition: "cataracts"
- Condition: "glaucoma"
- Condition: "ocular hypertension"
- Drug: "steroid"
- Drug: "immunosuppressive drug"
- Temporal: "within 6 months of surgery"
- Reference_point: "surgery"